Clinical trial exclusion criterion:
History of use of over 30mg oxycodone or equivalent per day

Annotated entities:
- Multiplier: "over 30mg per day"
- Drug: "oxycodone"
- Drug: "oxycodone equivalent"